Which technique led to the elucidation of the role of HOXD10 in regulating lymphatic endothelial responses to VEGF-C?

DeepCAGE transcriptomics identify HOXD10 as a transcription factor regulating lymphatic endothelial responses to VEGF-C.